Clinical trial exclusion criterion:
pregnant or breast feeding

Annotated entities:
- Condition: "pregnant"
- Observation: "breast feeding"